Subjects with femoral CICCs

The above is a clinical trial exclusion criterion. Annotated with entity spans:
Subjects with [Device: femoral CICCs]